慢性蕁麻疹（chronic urticaria）治療的第一線藥物為何？
A. 類固醇（corticosteroid）
B. 抗生素（antibiotic）
C. 免疫抑制劑（immunosuppressant）
D. 抗組織胺（antihistamine）

正確答案：D. 抗組織胺（antihistamine）